Clinical trial exclusion criterion:
Invasively mechanically ventilated >72 hours at the time of screening;

Entity relations:
- Has_temporal("mechanically ventilated", ">72 hours")